轉移性卵巢癌中之 Krukenberg tumor，其原發部位最常見者為何？
A. 肝
B. 肺
C. 乳房
D. 胃

正確答案：D. 胃